Clinical trial exclusion criterion:
Subjects receiving an investigational agent (including different formulation and generic agents of investigational drug) in the previous 3 months prior to screening.

Annotated entities:
- Competing_trial: "Subjects receiving an investigational agent (including different formulation and generic agents of investigational drug) in the previous 3 months prior to screening."